Clinical trial exclusion criterion:
Diagnosis as CD first time or first year.

Annotated entities:
- Condition: "CD"
- Qualifier: "first time"
- Qualifier: "first year"